Clinical trial inclusion criterion:
Early Syphilis Cases Determined to Be Serofast at 6 Months after Initial Treatment

Annotated entities:
- Condition: "Early Syphilis"
- Qualifier: "Serofast"
- Temporal: "6 Months after Initial Treatment"
- Reference_point: "Initial Treatment"
- Procedure: "Treatment"
- Multiplier: "Initial"